Clinical trial exclusion criterion:
History of ventricular tachycardia within 3 months before study entry; second- or third-degree atrioventricular block.

Annotated entities:
- Condition: "ventricular tachycardia"
- Temporal: "within 3 months"
- Condition: "third-degree atrioventricular block"
- Condition: "second- degree atrioventricular block"